急性腎絞痛（acute renal colic）時，其診斷率最高的影像學方法是：
A. 單純腹部攝影（KUB film）
B. 靜脈腎盂攝影（intravenous pyelography）
C. 無顯影劑電腦斷層（non-contrast spiral CT scan）
D. 腹部超音波（abdomen ultrasonography）

正確答案：C. 無顯影劑電腦斷層（non-contrast spiral CT scan）